Females of child bearing potential who are pregnant, breast-feeding or intend to become pregnant.

The above is a clinical trial exclusion criterion. Annotated with entity spans:
[Pregnancy_considerations: Females of child bearing potential who are pregnant, breast-feeding or intend to become pregnant].